Clinical trial exclusion criterion:
Active hepatobiliary disease

Entity relations:
- Has_qualifier("hepatobiliary disease", "Active")